下列有關人罹患豬囊尾幼蟲症（cysticercosis cellulosae）的敘述，何者錯誤？
A. 食入未熟帶蟲之豬肉，其囊蟲侵犯內臟器官致病
B. 也會在肌肉致病
C. 病患可能發生癲癇（epilepsy）
D. 血清抗體檢查有助於診斷

正確答案：A. 食入未熟帶蟲之豬肉，其囊蟲侵犯內臟器官致病